一位 20 歲男性兵役體檢發現體重 65 公斤、身高 165 公分、性器發育不良，血中 FSH 40 mIU/L（參 mIU/L），testosterone 100 μg/dL（參考值> 300 μg/dL），最可能診斷是：
A. Klinefelter syndrome
B. Kallmann syndrome
C. Prader-Willi syndrome
D. Laurence-Moon syndrome

正確答案：A. Klinefelter syndrome